活動性結核病的危險因素不包括下列那一項？
A. 愛滋病
B. 慢性腎衰竭
C. 使用類固醇等免疫抑制藥物
D. 幼兒

正確答案：D. 幼兒